關於輕躁症發作（hypomanic episode）在DSM-IV-TR的診斷準則（criteria）之敘述，下列何者正確？
A. 睡眠增加
B. 注意力集中
C. 比平常多話或不能克制地說個不停
D. 減少活動，社交退縮

正確答案：C. 比平常多話或不能克制地說個不停